一位 56 歲男性病人，因為左上肺葉腫瘤接受肺葉切除術。術後 12 小時，病人逐漸開始感到呼吸不順，心跳 100 次/min，體溫 38.9℃，血壓 130/80 mmHg，尿量每小時 90 mL，呼吸音局部降低，其最可能之診斷為何？
A. 低血量休克（hypovolemic shock）
B. 缺血性心臟病（ischemic heart disease）
C. 細菌性肺炎（bacterial pneumonia）
D. 肺膨脹不全（atelectasis）

正確答案：D. 肺膨脹不全（atelectasis）